Clinical trial exclusion criterion:
uncontrolled diabetes,

Annotated entities:
- Condition: "diabetes"
- Qualifier: "uncontrolled"